腦下垂體受到放射線治療，最常出現的激素異常是下列何者？
A. 生長激素（GH）
B. 泌乳激素（Prolactin）
C. 甲狀腺促進素（TSH）
D. 腎上腺促進素（ACTH）

正確答案：A. 生長激素（GH）